Clinical trial inclusion criterion:
Chronic pain for at least 3 months prior to inclusion, measured by VAS. (VAS 4 or above);

Annotated entities:
- Condition: "Chronic pain"
- Temporal: "at least 3 months prior"
- Reference_point: "inclusion"
- Procedure: "VAS"
- Qualifier: "measured by VAS"
- Measurement: "VAS"
- Value: "4 or above"
- Parsing_Error: "(VAS 4 or above);"